目前行政院衛生署建議的 11 項新生兒篩檢的項目不包括下列何項目？
A. 地中海性貧血（Thalassemia）
B. 中鏈脂肪酸去氫酶缺乏症（medium chain acyl-CoA dehydrogenase deficiency）
C. 戊二酸血症第一型（glutaric acidemia type I）
D. 異戊酸血症（isovaleric acidemia）

正確答案：A. 地中海性貧血（Thalassemia）